感染性心內膜炎病患在下列情況，通常會建議外科手術，何者除外？
A. 瓣膜功能受損造成心臟衰竭
B. 適當抗生素治療下持續菌血症
C. 金黃色葡萄球菌感染同時有主動脈瓣環膿瘍
D. 三尖瓣心內膜炎

正確答案：D. 三尖瓣心內膜炎